在血清中無法偵測到的肝炎標記為：
A. HBeAg
B. Anti-HBc
C. Anti-HEV
D. HBcAg

正確答案：D. HBcAg